Clinical trial inclusion criterion:
No previous iron supplementation

Entity relations:
- Has_temporal("iron supplementation", "previous")
- Has_negation("iron supplementation", "No")